Clinical trial exclusion criterion:
OAT required for reasons not related to AF (i.e., prosthetic valve, PV stenosis, previous pulmonary embolism, presence of spontaneous echo contrast [SEC] at standard echo performed at 3-months follow-up).

Annotated entities:
- Drug: "OAT"
- Negation: "not"
- Qualifier: "AF"
- Device: "prosthetic valve"
- Condition: "PV stenosis"
- Condition: "pulmonary embolism"
- Measurement: "standard echo"
- Temporal: "3-months follow-up"
- Reference_point: "follow-up"
- Value: "spontaneous echo contrast"
- Value: "SEC"